¿Cuál de las opciones que se muestran es la correcta?:
1. Las ciencias sociales se configuran como disciplinas a partir del S.XVIII.
2. Paradigmas comunes a la Sociología y la Antropología son el idealismo y el positivismo.
3. La Ilustración favoreció la configuración teórica de las ciencias sociales.
4. Ancestros comunes de la Antropología y la Sociología son: Marx, Goffman, Comte y Durkheim.

Respuesta correcta: 3. La Ilustración favoreció la configuración teórica de las ciencias sociales.